在使用人工瓣膜置換後的長期追蹤中，和瓣膜有關的死亡（valve-related death）最常見的原因為：
A. 感染性內膜炎
B. 出血
C. 再度手術
D. 血栓及栓塞症

正確答案：D. 血栓及栓塞症